我國縣市政府衛生局每年會針對轄區民眾舉辦複合式成人健康檢查，並篩檢出異常個案加以轉介追蹤，上述的服務措施在公共衛生三段五級的預防工作中是屬於下列何者？
A. 第二段第三級
B. 第一段第二級
C. 第二段第四級
D. 第三段第二級

正確答案：A. 第二段第三級